Clinical trial exclusion criterion:
Exclusions Based on Concomitant Medication Use

Annotated entities:
- Parsing_Error: "Exclusions Based on Concomitant Medication Use"